Clinical trial inclusion criterion:
children and teenagers aged less than 20 years,

Annotated entities:
- Person: "children"
- Person: "teenagers"
- Person: "aged"
- Value: "less than 20 years"